Clinical trial exclusion criterion:
History of neurological injury: head trauma, poorly-controlled seizure disorder (seizure within the preceding six months), stroke, prior neurosurgery, or under the care of a neurologist or neurosurgeon as determined by interview

Annotated entities:
- Condition: "neurological injury"
- Temporal: "History"
- Condition: "head trauma"
- Condition: "seizure disorder"
- Qualifier: "poorly-controlled"
- Condition: "seizure"
- Temporal: "within the preceding six months"
- Condition: "stroke"
- Condition: "neurosurgery"
- Temporal: "prior"
- Observation: "under the care of a neurologist"
- Observation: "under the care of a neurosurgeon"